Primary ITP according to the definition of Rodeghiero et al. (52) and a platelet count of <30x109/l

The above is a clinical trial inclusion criterion. Annotated with entity spans:
[Condition: Primary ITP] according to the [Measurement: definition of Rodeghiero] et al. (52) and a [Measurement: platelet count] of [Value: <30x109/l]